El enunciado diagnóstico: “Riesgo de deterioro de la integridad cutánea relacionado con cambios posturales poco frecuentes”, es INCORRECTO, porque:
1. Contiene expresiones que indican juicios de valor y sin fundamentar, por parte de la enfermera.
2. Utiliza el término “relacionado con” y habría que utilizar “debido a”, ya que es evidente la causa.
3. No se especifican los signos y los síntomas.
4. Contiene expresiones que pueden comprometer legalmente a la enfermera.
5. Los cambios posturales poco frecuentes, deben ser considerados como un factor secundario del problema.

Respuesta correcta: 4. Contiene expresiones que pueden comprometer legalmente a la enfermera.